真核細胞蛋白質合成的啟始階段（initiation stage）需要轉譯起始因子4F（eIF4F）複合物的參與，下列那一種轉譯起始因子不包含於此種複合物中？
A. eIF4A
B. eIF4B
C. eIF4E
D. eIF4G

正確答案：B. eIF4B